Subjects admitted for trauma surgery

The above is a clinical trial exclusion criterion. Annotated with entity spans:
Subjects admitted for [Procedure: trauma surgery]